依據世界衛生組織對安寧緩和醫療所作的闡釋，下列何者符合安寧緩和醫療的特質與精神？
A. 安寧緩和醫療實施的對象為病人，而非家屬
B. 安寧緩和醫療為延緩死亡，而非加速死亡
C. 安寧緩和醫療應從診斷時就能介入，而非等到臨終前數週才介入
D. 安寧緩和醫療實施的疾病種類為癌症末期，而非其他慢性疾病的末期

正確答案：C. 安寧緩和醫療應從診斷時就能介入，而非等到臨終前數週才介入